Clinical trial inclusion criterion:
no previous treatment

Entity relations:
- Has_temporal("treatment", "previous")
- Has_negation("treatment", "no")